下列對於痛風之治療，何者正確？
A. Aspirin 是治療痛風很好的抗發炎藥物
B. Colchicine 用來治療急性痛風發作
C. Probenecid 用來治療慢性痛風時，應少喝水以使藥物在腎臟局部濃度增加，增強效果
D. Allopurinol 減少尿酸之形成是因為抑制了 superoxide dismutase

正確答案：B. Colchicine 用來治療急性痛風發作